Allergy to porphyrins and analogues; Photosensitivity; Porphyria; Allergic constitution;

The above is a clinical trial exclusion criterion. Annotated with entity spans:
[Condition: Allergy] to [Drug: porphyrins] and analogues; [Condition: Photosensitivity]; [Condition: Porphyria]; [Condition: Allergic constitution];